關於右心室梗塞，下列敘述何者錯誤？
A. 約占下壁心肌梗塞患者之三分之一
B. 常合併低血壓
C. 心電圖 ST 節段變化發生於右胸導程
D. 因合併右心室衰竭，須使用利尿劑及限制水分攝取

正確答案：D. 因合併右心室衰竭，須使用利尿劑及限制水分攝取